Clinical trial exclusion criterion:
Positive urine toxicology.

Annotated entities:
- Measurement: "urine toxicology"
- Value: "Positive"